Clinical trial inclusion criterion:
American Society of Anesthesiologists (ASA) 1-3 patients undergoing primary total hip arthroplasty

Entity relations:
- Subsumes("American Society of Anesthesiologists", "ASA")
- Has_value("American Society of Anesthesiologists", "1-3")